Clinical trial exclusion criterion:
Perforated corneal ulcer

Annotated entities:
- Condition: "corneal ulcer"
- Qualifier: "Perforated"